Clinical trial exclusion criterion:
Women who are pregnant or breastfeeding.

Annotated entities:
- Pregnancy_considerations: "Women who are pregnant or breastfeeding"